Living in the study clusters

The above is a clinical trial inclusion criterion. Annotated with entity spans:
[Non-query-able: Living in the study clusters]